Adequate liver function (serum total bilirubin < 2 times the upper normal limit (UNL); serum transaminases levels <3 times [<5 times for patients with liver metastasis] UNL)

The above is a clinical trial inclusion criterion. Annotated with entity spans:
[Value: Adequate] [Measurement: liver function] ([Measurement: serum total bilirubin] [Value: < 2 times the upper normal limit (UNL)]; [Measurement: serum transaminases levels] [Value: <3 times] [[Value: <5 times] for patients with [Condition: liver metastasis]] UNL)